4. Years, range 18-60

The above is a clinical trial inclusion criterion. Annotated with entity spans:
4. [Person: Years], range [Value: 18-60]